Patients with symptomatic CNS metastases or leptomeningeal involvement

The above is a clinical trial exclusion criterion. Annotated with entity spans:
Patients with [Qualifier: symptomatic] [Condition: CNS metastases] or [Condition: leptomeningeal involvement]